List psychiatric diseases that are associated with Synaptosome Associated Protein 25 (snap25).

attention-deficit/hyperactivity disorder
bipolar
schizophrenia